Clinical trial inclusion criterion:
Newly diagnosed and untreated sputum smear positive tuberculosis patient

Entity relations:
- Has_value("sputum smear", "positive")
- AND("tuberculosis", "sputum smear")
- Has_qualifier("tuberculosis", "Newly diagnosed")
- OR("Newly diagnosed", "untreated")